有關heparin之敘述，下列何者正確？
A. 具有溶血栓活性
B. 可抑制血小板凝集反應
C. 可結合至antithrombin III，以達抗凝血活性
D. 可抑制肝臟中vitamin K之再生

正確答案：C. 可結合至antithrombin III，以達抗凝血活性